Clinical trial inclusion criterion:
Hospitalised children aged 3-mo to 5-yrs (in Darwin, children have to be Indigenous)

Entity relations:
- Has_value("aged", "3-mo to 5-yrs")